Clinical trial exclusion criterion:
Pregnant and lactating women

Entity relations:
- OR("Pregnant", "lactating")